志明和春嬌結婚後發現他們的祖母是表姊妹。他們生下的女兒小英特別容易得到肺炎鏈球菌和嗜血桿菌的感染。免疫學檢查發現小英的 IgM 血清濃度正常但缺乏其他 isotype 的抗體，並且其抗體的抗原結合部位缺乏高頻率突變導入的多樣性。小英最可能有下列何種疾病？
A. Selective IgA deficiency
B. Bruton's agammaglobulinemia
C. Hyper IgE syndrome
D. Autosomal inherited defect in the AID（activation-induced cytidine deaminase） gene

正確答案：D. Autosomal inherited defect in the AID（activation-induced cytidine deaminase） gene